缺乏維生素 B12最可能會導致下列何種疾病？
A. 腳氣病（beriberi）
B. 壞血病（scurvy）
C. 惡性貧血（pernicious anemia）
D. 口角炎（angular stomatitis）

正確答案：C. 惡性貧血（pernicious anemia）